尺神經（ulnar nerve）沒有支配到下列何者？
A. 尺側屈腕肌（flexor carpi ulnaris）
B. 拇內收肌（adductor pollicis）
C. 尺側伸腕肌（extensor carpi ulnaris）
D. 屈指深肌（flexor digitorum profundus）

正確答案：C. 尺側伸腕肌（extensor carpi ulnaris）